Schirmer-1 test >5 mm after 5 min

The above is a clinical trial inclusion criterion. Annotated with entity spans:
[Measurement: Schirmer-1 test] [Value: >5 mm] [Temporal: after 5 min]